Abnormal liver function (AST/ALT > x3 upper normal limit)

The above is a clinical trial exclusion criterion. Annotated with entity spans:
[Value: Abnormal] [Measurement: liver function] ([Measurement: AST/ALT] [Value: > x3 upper normal limit])